Patients with hepatic impairment (child-Pugh staging, calibration = 5) or renal impairment (creatinine clearance = 30ml / min), recent peptic ulcer, a history of hypersensitivity to cilostazol, cancer patients undergoing treatment.

The above is a clinical trial exclusion criterion. Annotated with entity spans:
Patients with [Condition: hepatic impairment] ([Measurement: child-Pugh staging], [Value: calibration = 5]) or [Condition: renal impairment] ([Measurement: creatinine clearance] [Value: = 30ml / min]), [Temporal: recent] [Condition: peptic ulcer], a [Temporal: history of] [Condition: hypersensitivity] to [Drug: cilostazol], [Condition: cancer] patients undergoing [Procedure: treatment].